Documentation of HIV diagnosis in the medical record by a healthcare provider.

The above is a clinical trial inclusion criterion. Annotated with entity spans:
Documentation of [Condition: HIV diagnosis] in the medical record by a healthcare provider.